The parent/guardian must be willing and capable of providing permission for their child to participate through the written informed consent process

The above is a clinical trial inclusion criterion. Annotated with entity spans:
[Informed_consent: The parent/guardian must be willing and capable of providing permission for their child to participate through the written informed consent process]